Clinical trial exclusion criterion:
14. Concomitant administration of any prescription or over the counter medications known to alter P450 enzyme or P-gp activity

Entity relations:
- Has_temporal("medications known to alter P-gp activity", "Concomitant")
- OR("medications known to alter P-gp activity", "medications known to alter P450 enzyme activity")